Clinical trial inclusion criterion:
Born, raised and currently living at low altitude (<800m).

Entity relations:
- Subsumes("living at low altitude", "living at <800m")